Informed consent obtained prior to any screening procedure

The above is a clinical trial inclusion criterion. Annotated with entity spans:
[Post-eligibility: Informed consent obtained prior to any screening procedure]